Clinical trial inclusion criterion:
Serum or plasma potassium level greater than or equal to 3.5 meq/L

Annotated entities:
- Qualifier: "Serum"
- Qualifier: "plasma"
- Measurement: "potassium level"
- Value: "greater than or equal to 3.5 meq/L"